Clinical trial exclusion criterion:
Daily use of of antioxidants >300mg

Annotated entities:
- Multiplier: "Daily use"
- Drug: "antioxidants"
- Multiplier: ">300mg"